下列何者最常引起人工瓣膜之心內膜炎（endocarditis of artificial valve）？
A. 鏈球菌（Streptococci）
B. 葡萄球菌（Staphylococci）
C. 腸內桿菌科細菌（Enterobacteriaceae）
D. 布魯氏桿菌屬（Brucella spp.）

正確答案：B. 葡萄球菌（Staphylococci）